Clinical trial exclusion criteria:
Patients with combined HCV/HBV co-infection
hepatocellular carcinoma (HCC)
decompensated liver cirrhosis (Child-Pugh score above 6)
non-genotype 4

Annotated entities:
- Condition: "HCV infection"
- Condition: "HBV infection"
- Condition: "hepatocellular carcinoma (HCC)"
- Condition: "liver cirrhosis"
- Qualifier: "decompensated"
- Measurement: "Child-Pugh score"
- Value: "above 6"
- Condition: "genotype 4"
- Negation: "non"